某位 30 歲孕婦，G1P0，月經規則，週期 28 天，每次月經五天，自訴：最終月經第一天（LMP）是 年 2 月 1 日，則預產期（EDC）是何時？
A. 2005 年 9 月 8 日
B. 2005 年 10 月 8 日
C. 2005 年 11 月 8 日
D. 2005 年 12 月 8 日

正確答案：C. 2005 年 11 月 8 日